A history of cataract surgery complications/vitreous loss in the study eye.

The above is a clinical trial exclusion criterion. Annotated with entity spans:
A [Temporal: history of] [Condition: cataract surgery complications]/[Condition: vitreous loss] [Qualifier: in the study eye].